Clinical trial exclusion criterion:
Hypersensibility to ingredients of intervention

Annotated entities:
- Condition: "Hypersensibility"
- Drug: "ingredients of intervention"